人類免疫不全病毒（HIV）感染者感染梅毒（syphilis）或其他性行為傳染疾病的臨床表徵敘述，何者錯誤？
A. 人類免疫不全病毒感染者感染到梅毒，與一般人比較其疾病嚴重度及病程進展並無不同
B. 大多數人類免疫不全病毒感染者的血清學檢測可用於確認梅毒的診斷
C. 感染淋病（gonorrhea）可能會增加人類免疫不全病毒感染的危險，且淋病在男性不一定有明顯的症狀，更需小心診斷
D. 梅毒是人類免疫不全病毒感染的危險因素

正確答案：A. 人類免疫不全病毒感染者感染到梅毒，與一般人比較其疾病嚴重度及病程進展並無不同